Clinical trial inclusion criterion:
The patients underwent neoadjuvant chemotherapy plus surgery or directly modified radical mastectomy or breast-conserving surgery (plus sentinel lymph node biopsy or axillary lymph node dissection) after diagnosis of breast cancer.

Annotated entities:
- Procedure: "neoadjuvant chemotherapy"
- Procedure: "surgery"
- Procedure: "radical mastectomy"
- Qualifier: "directly modified"
- Procedure: "breast-conserving surgery"
- Procedure: "sentinel lymph node biopsy"
- Procedure: "axillary lymph node dissection"
- Temporal: "after diagnosis of breast cancer"
- Reference_point: "diagnosis of breast cancer"